Clinical trial exclusion criterion:
Tricuspid valve stenosis, Supra-pulmonary valve stenosis

Annotated entities:
- Condition: "Tricuspid valve stenosis"
- Condition: "Supra-pulmonary valve stenosis"